Clinical trial inclusion criteria:
Adult patients aged (>18), males and females, undergoing elective coronary artery bypass graft (CABG) surgery with cardiopulmonary bypass (CPB).

Annotated entities:
- Person: "aged"
- Value: ">18"
- Person: "males"
- Person: "females"
- Qualifier: "elective"
- Procedure: "surgery coronary artery bypass graft"
- Procedure: "CABG"
- Procedure: "cardiopulmonary bypass"
- Procedure: "CPB"